自體免疫胰島素-依賴性糖尿病（Autoimmune insulin-dependent diabetes mellitus）的致病原因為：
A. IgG 免疫複合物在 beta 細胞的沉積（IgG immune complex deposition to beta cells）
B. 抗 snRNP, scRNP（核糖蛋白）的自體抗體（autoantibodies to snRNP, scRNP (ribonuclear proteins)）
C. 胰臟細胞外間質的自體抗體（autoantibodies to extracellar matrix in pancreas）
D. 胰島 beta 細胞受到 T 細胞的破壞（T cell-mediated damage of pancreatic beta cells）

正確答案：D. 胰島 beta 細胞受到 T 細胞的破壞（T cell-mediated damage of pancreatic beta cells）